Do the Sleeping Beauty or the piggyBac transposons have higher transposition efficiency?

Compared with Sleeping Beauty, PiggyBac exhibits higher transposition efficiencies.